Immunosuppression with cyclosporine or an mTOR inhibitor (everolimus or sirolimus).

The above is a clinical trial exclusion criterion. Annotated with entity spans:
[Procedure: Immunosuppression] with [Drug: cyclosporine] or an [Drug: mTOR inhibitor] ([Drug: everolimus] or [Drug: sirolimus]).